一位 39 歲婦女，G1P1，例行性的超音波檢查發現有一個子宮肌瘤 6×6×5 公分，卵巢正常。她沒有頻尿、排便困難等任何症狀。下一步最適合的處置是什麼？
A. 注射 gonadotropin-releasing hormone（GnRH）agonists 療法
B. 剖腹切除肌瘤手術
C. 追蹤六個月再檢查一次
D. 腹腔鏡肌瘤切除手術

正確答案：C. 追蹤六個月再檢查一次